What cellular process is the protein clathrin involved in?

while clathrin mediated endocytosis w. Receptor-mediated endocytosis proceeds by transfer of receptor-ligand complexes from clathrin-coated pits at the cell surface to uncoated endocytic vesicles termed receptosomes (or endosomes).